Clinical trial inclusion criterion:
LVAD on warfarin requiring temporary interruption of anticoagulation for procedures

Entity relations:
- AND("LVAD", "warfarin")
- Has_qualifier("warfarin", "requiring temporary interruption of anticoagulation for procedures")